history of renal, hepatic, cardiac or pulmonary severe disease

The above is a clinical trial exclusion criterion. Annotated with entity spans:
history of [Condition: renal], [Condition: hepatic], [Condition: cardiac] or [Condition: pulmonary] [Qualifier: severe] disease